History of alcohol or drug abuse in the previous 3 months

The above is a clinical trial exclusion criterion. Annotated with entity spans:
History of [Condition: alcohol] or [Condition: drug abuse] [Temporal: in the previous 3 months]